Clinical trial inclusion criterion:
Singleton pregnancy at gestational age 36 weeks or more

Entity relations:
- Has_value("gestational age", "36 weeks or more")